部分葡萄胎妊娠（partial molar pregnancy），最常見的染色體類型為何？
A. 46, XX
B. 46, XY
C. 69, XXY
D. 69, XYY

正確答案：C. 69, XXY